Clinical trial inclusion criterion:
Foot ulcer duration more than 6 weeks

Entity relations:
- Has_temporal("Foot ulcer", "more than 6 weeks")